Clinical trial inclusion criterion:
Able and willing to provide fully informed consent or parent/guardian able to provide consent

Annotated entities:
- Informed_consent: "Able and willing to provide fully informed consent or parent/guardian able to provide consent"